Clinical trial inclusion criterion:
Able to provide informed consent indicating that they understand the purpose of this study and are willing to adhere to the procedures described in this protocol

Annotated entities:
- Non-query-able: "Able to provide informed consent indicating that they understand the purpose of this study and are willing to adhere to the procedures described in this protocol"